Clinical trial inclusion criteria:
Systemically healthy adults.
Minimum of 24 permanent teeth.
No gingivitis (Community Periodontal Index score = 0).
No periodontitis (Community Periodontal Index score = 0).
Absence of untreated caries.

Annotated entities:
- Qualifier: "Systemically"
- Condition: "healthy"
- Person: "adults"
- Multiplier: "Minimum of 24"
- Observation: "permanent teeth"
- Negation: "No"
- Condition: "gingivitis"
- Measurement: "Community Periodontal Index score"
- Value: "= 0"
- Negation: "No"
- Condition: "periodontitis"
- Measurement: "Community Periodontal Index score"
- Value: "= 0"
- Qualifier: "untreated"
- Condition: "caries"
- Negation: "Absence"